Galantamine屬於膽鹼酯酶抑制劑（cholinesterase inhibitors），最適合用於治療下列何種疾病？
A. 重症肌無力（myasthenia gravis）
B. 帕金森氏症（Parkinson's disease）
C. 青光眼（glaucoma）
D. 阿茲海默症（Alzheimer's disease）

正確答案：D. 阿茲海默症（Alzheimer's disease）